En el estudio de la fiabilidad de un test, los métodos basados en la división del test en dos mitades miden:
1. La estabilidad de las medidas del test.
2. La equivalencia de las medidas del test.
3. La consistencia interna del test.
4. El error de medida del test.

Respuesta correcta: 3. La consistencia interna del test.